Manual manoeuvres to facilitate =25% of defecations

The above is a clinical trial inclusion criterion. Annotated with entity spans:
[Procedure: Manual manoeuvres] to facilitate [Multiplier: =25%] of [Condition: defecations]